Clinical trial exclusion criterion:
Antitumor therapy (e.g., chemotherapy, hormonal therapy, immunotherapy, antibody therapy, radiotherapy), or investigational agent or therapy <=30 days before first dose of study treatment or not recovered from any acute toxicity.

Annotated entities:
- Procedure: "Antitumor therapy"
- Procedure: "chemotherapy"
- Procedure: "hormonal therapy"
- Procedure: "immunotherapy"
- Procedure: "antibody therapy"
- Procedure: "radiotherapy"
- Drug: "investigational agent"
- Procedure: "therapy"
- Temporal: "<=30 days before first dose of study treatment"
- Condition: "not recovered from any acute toxicity"
- Reference_point: "first dose of study treatment"